(i.e. history of a severe allergic reaction to skin tests,,

The above is a clinical trial exclusion criterion. Annotated with entity spans:
(i.e. [Temporal: history] of a [Condition: severe allergic reaction] to [Procedure: skin tests],,